Con respecto a la conducta ante pacientes obstétricas expuestas a la Varicela, es FALSO:
1. Se debe separar a las mujeres infectadas de otras pacientes obstétricas.
2. Todas las pacientes obstétricas expuestas, sin certeza de inmunidad previa, deben realizarse una determinación serológica de su estado de inmunización.
3. Se debe administrar inmunoglobulina específica a las pacientes obstétricas expuestas no inmunes.
4. El plazo máximo para administrar la inmunoglobulina específica tras el contacto es de 96 horas.
5. Las gestantes sin inmunidad al virus Varicela-Zóster pueden vacunarse durante la gestación para prevenir la primoinfección.

Respuesta correcta: 5. Las gestantes sin inmunidad al virus Varicela-Zóster pueden vacunarse durante la gestación para prevenir la primoinfección.